Clinical trial exclusion criterion:
Human immunodeficiency virus infection

Annotated entities:
- Condition: "Human immunodeficiency virus infection"